¿Cuál de las siguientes afirmaciones del metamizol es FALSA?
1. El riesgo relativo de agranulocitosis es más elevado que con otros AINES.
2. El riesgo de que produzca anemia aplásica es bajo.
3. Presenta mayor riesgo de producir lesiones gástricas que otros AINES.
4. Pueden potenciar el efecto de los anticoagulantes orales.
5. Si se administra vía intravenosa rápida puede producir hipotensión.

Respuesta correcta: 3. Presenta mayor riesgo de producir lesiones gástricas que otros AINES.